6. Oral steroids unless patients present a low stable dose (e.g. 10 mg or less of prednisone per day or physiological doses, less than 35 mg/day, of hydrocortisone Cortef®). Inhale steroids at stable dose in the last month are acceptable.

The above is a clinical trial exclusion criterion. Annotated with entity spans:
[Parsing_Error: 6.] [Drug: Oral steroids] [Negation: unless] patients present a [Qualifier: low] [Qualifier: stable dose] (e.g. [Multiplier: 10 mg or less] of [Drug: prednisone] per day or [Multiplier: physiological doses], [Multiplier: less than 35 mg/day], of [Drug: hydrocortisone] [Drug: Cortef]®). [Grammar_Error: Inhale steroids at stable dose in the last month are acceptable].